Measurable metastatic disease as defined by Response Evaluation Criteria in Solid Tumors (RECIST)

The above is a clinical trial inclusion criterion. Annotated with entity spans:
Measurable [Condition: metastatic disease] as defined by [Measurement: Response Evaluation Criteria in Solid Tumors (RECIST)]